Use of prohibited medications, in particular, agents known to be nephrotoxic or drugs slow in renal excretion.

The above is a clinical trial exclusion criterion. Annotated with entity spans:
[Undefined_semantics: Use of prohibited medications], in particular, [Procedure: agents] known to be [Qualifier: nephrotoxic] or [Procedure: drugs] [Qualifier: slow in renal excretion].